Recent history of myocardial infarction, cerebrovascular accident, cardiac arrhythmias, or unstable heart disease.

The above is a clinical trial exclusion criterion. Annotated with entity spans:
[Temporal: Recent] [Temporal: history] of [Condition: myocardial infarction], [Condition: cerebrovascular accident], [Condition: cardiac arrhythmias], or [Condition: unstable heart disease].